下列何者最能描述流行病學（epidemiology）的定義？
A. 經由建立動物模式（animal model）來研究疾病的成因及治療方法
B. 對人群中疾病頻率分布（distribution）及其決定因子（determinants）的研究
C. 探討隨機變異（random variation）特性的理論統計學研究
D. 針對疫情（epidemic）的研究，不具傳染性的疾病即不屬於流行病學研究的對象

正確答案：B. 對人群中疾病頻率分布（distribution）及其決定因子（determinants）的研究